33歲女性，G2P1，前胎因胎位不正接受剖腹產；此次懷孕，於妊娠35週時發現陰道大量出血，接受緊急剖腹產，於術中發現前置胎盤併植入性胎盤，接受子宮全切除術。相較於術前已確診並計畫接受剖腹產併子宮全切除之病患，此產婦手術中發生，下列何種併發症的機會較高？
A. 膀胱損傷（bladder injury）
B. 腸損傷（bowel injury）
C. 靜脈血管栓塞（venous thromboembolism）
D. 羊水栓塞（amniotic fluid embolism）

正確答案：A. 膀胱損傷（bladder injury）